Clinical trial exclusion criterion:
Prior therapy with agents targeting the DR5 apoptosis pathway

Entity relations:
- OR("Prior", "agents targeting the DR5 apoptosis pathway", "therapy")